胎兒肺臟發育晚期之肺泡期（alveolar period）中，末端小囊（terminal saccule）相當於下列何種結構？
A. 細支氣管（bronchiole）
B. 肺泡（Alveolus）
C. 肺泡孔（Alveolar pore）
D. 肺泡管（Alveolar duct）

正確答案：D. 肺泡管（Alveolar duct）